(2) Female infertility due to surgery (no ovaries and / or uterus)

The above is a clinical trial exclusion criterion. Annotated with entity spans:
(2) [Person: Female] [Condition: infertility] [Qualifier: due to surgery] ([Condition: no ovaries] and / or uterus)